Clinical trial exclusion criterion:
Heart attack within the last six months or progressive coronary artery disease,

Entity relations:
- Has_temporal("Heart attack", "within the last six months")
- Has_index("within the last six months", "the last six months")
- OR("Heart attack", "progressive coronary artery disease")